活產嬰兒約1～2%有染色體異常。下列那一個臨床情境最不需要做染色體檢查？
A. 周產期窒息導致腦性麻痺（Cerebral palsy, perinatal asphyxia induced）
B. 多重畸形（Ｍultiple congenital anomalies）
C. 心智障礙（Intellectual disability）
D. 生長畸變（Growth aberration）

正確答案：A. 周產期窒息導致腦性麻痺（Cerebral palsy, perinatal asphyxia induced）